70 歲男性，有慢性腎功能衰竭及甲狀腺濾泡癌。多年前甲狀腺癌曾接受過手術，且接受過放射性碘治療，但現又在肺出現多處轉移。下列何種處置最適宜？
A. 停服甲狀腺素四星期後，給予放射性碘治療
B. 注射基因工程合成的甲促素（TSH），再給予放射性碘
C. 手術切除肺部轉移病變
D. 使用標靶治療

正確答案：B. 注射基因工程合成的甲促素（TSH），再給予放射性碘